All solid organ transplant recipients receiving their care at Seattle Children's Hospital

The above is a clinical trial inclusion criterion. Annotated with entity spans:
All [Procedure: solid organ transplant] recipients receiving their care at [Visit: Seattle Children's Hospital]